某病患下肢不慎遭重物壓迫長達 4 小時後才得以脫困，到院後血壓 70/46 mmHg，下列敘述及緊急處置，何者錯誤？
A. 立即給與足量生理食鹽水
B. 給與 KCl 治療其低血鉀
C. 鹼化尿液可減少肌蛋白於腎小管內沈澱
D. 會出現瀰漫性血管內凝固及低血鈣

正確答案：B. 給與 KCl 治療其低血鉀